12. Severe hypertension with systolic >200 mmHg and diastolic >110 mmHg at rest;

The above is a clinical trial exclusion criterion. Annotated with entity spans:
[Parsing_Error: 12.] [Condition: Severe hypertension] with [Measurement: systolic] [Value: >200 mmHg] and [Measurement: diastolic] [Value: >110 mmHg] at rest;